下列關於移植體對抗宿主疾病（graft-versus-host disease, GVHD）的敘述何者錯誤？
A. 可分為急性及慢性兩種不同型態
B. 臨床上除了皮膚病灶之外，常合併腹瀉以及肝功能異常之表現
C. 常出現於接受骨髓移植（bone marrow transplantation）之患者
D. 自體（autologous）骨髓移植之患者罹患率遠高於異體（allogeneic）移植之患者

正確答案：D. 自體（autologous）骨髓移植之患者罹患率遠高於異體（allogeneic）移植之患者